Clinical trial inclusion criterion:
Are willing/able to adhere to the prohibitions and restrictions specified in the protocol and study procedures

Annotated entities:
- Post-eligibility: "Are willing/able to adhere to the prohibitions and restrictions specified in the protocol and study procedures"
- Non-query-able: "Are willing/able to adhere to the prohibitions and restrictions specified in the protocol and study procedures"